How is Burke-Fahn-Marsden Dystonia scale used?

Motor responses and disease severity in conditions such as cerebral palsy or other dystonias can be measured with the Burke-Fahn-Marsden Dystonia Rating Scale (BFMDRS). This scale can be use to track surgery or treatment response.